Clinical trial exclusion criterion:
Have bleeding or clotting disorder

Entity relations:
- OR("bleeding disorder", "clotting disorder")